嬰兒肌肉性斜頸（torticollis）最常見的形成原因是下列那條肌肉纖維化？
A. 闊頸肌（platysma muscle）
B. 肩胛舌骨肌（omohyoid muscle）
C. 胸骨舌骨肌（sternohyoid muscle）
D. 胸鎖乳突肌（sternocleidomastoid muscle）

正確答案：D. 胸鎖乳突肌（sternocleidomastoid muscle）